最常見轉移性腦瘤之原發處，依發生比例由多到少之排序為何？
A. 乳房＞肺＞腎＞腸胃道
B. 肺＞乳房＞腎＞腸胃道
C. 腸胃道＞腎＞乳房＞肺
D. 腎＞肺＞乳房＞腸胃道

正確答案：B. 肺＞乳房＞腎＞腸胃道